Clinical trial exclusion criterion:
mobile plaque in the aorta;

Annotated entities:
- Condition: "mobile plaque in the aorta"